一位 88 歲、健康狀況不佳、住在護理之家的單身婦女，主訴解尿及解便的功能不順暢，身體診查時發現其子宮完全脫出，最佳的治療建議為：
A. 經腹部子宮懸吊術
B. 經陰道子宮懸吊術
C. 使用子宮托或陰道托（pessary）
D. 建議其包尿布和穿著合身的內褲

正確答案：C. 使用子宮托或陰道托（pessary）